Clinical trial exclusion criterion:
Any MS relapse in the last five years, as determined at the screen visit by the PI

Entity relations:
- AND("relapse", "MS")
- Has_temporal("relapse", "in the last five years")